下列何種腫瘤最不可能發生在鼻咽腔？
A. 血管纖維瘤（angiofibroma）
B. 混合瘤（mixed tumor）
C. 淋巴瘤（lymphoma）
D. 基底細胞瘤（basal cell carcinoma）

正確答案：D. 基底細胞瘤（basal cell carcinoma）